Clinical trial exclusion criterion:
the child has as a mid upper arm circumference < 110 mm and is older than 6 months (most feasible local indicator of AIDS and chronic immunosuppressive disease)

Entity relations:
- Has_value("mid upper arm circumference", "< 110 mm")
- Has_value("old", "is older than 6 months")